History of corneal ulcers or fungal infections

The above is a clinical trial exclusion criterion. Annotated with entity spans:
[Temporal: History] of [Condition: corneal ulcers] or [Condition: fungal infections]